Subject is morbidly obese (defined as a body mass index >40, or weighs more than 100 lbs over ideal body weight).

The above is a clinical trial exclusion criterion. Annotated with entity spans:
Subject is [Condition: morbidly obese] (defined as a [Measurement: body mass index] [Value: >40], or [Measurement: weighs] [Value: more than 100 lbs over ideal body weight]).